Clinical trial inclusion criterion:
For women of childbearing potential and men with partners of childbearing potential, agreement to use a highly effective, non-hormonal form of contraception or 2 effective forms of non-hormonal contraception by the patient and/or partner. Contraception use must continue for the duration of study treatment and for at least 6 months after the last dose of study treatment. Male patients whose partners are pregnant should use condoms for the duration of the study.

Annotated entities:
- Person: "women"
- Condition: "childbearing potential"
- Person: "men"
- Observation: "with partners of childbearing potential"
- Qualifier: "highly effective"
- Qualifier: "non-hormonal"
- Procedure: "contraception"
- Multiplier: "2"
- Procedure: "non-hormonal contraception"
- Procedure: "Contraception"
- Temporal: "continue for the duration of study treatment"
- Reference_point: "study treatment"
- Temporal: "for at least 6 months after the last dose of study treatment"
- Reference_point: "the last dose of study treatment"
- Person: "Male"
- Observation: "partners are pregnant"
- Device: "condoms"
- Temporal: "for the duration of the study"